Those subjects with previous use of vitamin D.

The above is a clinical trial exclusion criterion. Annotated with entity spans:
Those subjects with [Temporal: previous use] of [Drug: vitamin D].